Amenorrhea and FSH> 30mUI/ml according to the criteria of the index subject

The above is a clinical trial inclusion criterion. Annotated with entity spans:
[Condition: Amenorrhea] and [Measurement: FSH][Value: > 30mUI/ml] according to the criteria of the index subject